有關無肛症（imperforate anus）之敘述，下列何者正確？①低位無肛症，一般是直接做肛門直腸成形手術 ②高位無肛症都是先做大腸造口，等幾個月後再做肛門直腸成形手術 ③容易合併的先天性異常包括脊柱、心臟、食道及泌尿系統 ④高位無肛症最常合併直腸膀胱瘻管 ⑤出生後要 快照側面的腹部X光片來決定分型
A. ①②③④⑤
B. 僅①②④⑤
C. 僅①③④⑤
D. 僅①②③

正確答案：D. 僅①②③